Clinical trial inclusion criterion:
Diagnosis of T2DM before the age of 60 years of age

Entity relations:
- Has_value("age", "before 60 years of age")